Clinical trial inclusion criterion:
6. Are not currently taking melatonin.

Entity relations:
- Has_temporal("melatonin", "currently")
- Has_negation("melatonin", "not")